Restenosis

The above is a clinical trial exclusion criterion. Annotated with entity spans:
[Condition: Restenosis]